Clinical trial inclusion criterion:
Creatinine clearance <60mL/min

Annotated entities:
- Measurement: "Creatinine clearance"
- Value: "<60mL/min"